Clinical trial inclusion criterion:
aged 18 or older,

Entity relations:
- Has_value("aged", "18 or older")